Known or suspected illicit drug or alcohol abuse

The above is a clinical trial exclusion criterion. Annotated with entity spans:
Known or suspected [Condition: illicit drug] or [Condition: alcohol abuse]